Dentro de las funciones administrativas de una institución sanitaria, un principio de la organización es “que la delegación surta el efecto planeado, cada nivel de autoridad debe tomar las decisiones que sean de su competencia, sin permitir que se trasfieran a otros niveles de autoridad”. Esta definición atiende al principio de organización:
1. Tramo de control.
2. De la jerarquía.
3. De la división del trabajo.
4. Del nivel de autoridad.

Respuesta correcta: 4. Del nivel de autoridad.